下列何者不是腎臟製造的荷爾蒙？
A. 腎素（renin）
B. 皮質醛固酮（aldosterone）
C. 紅血球生成素（erythropoietin）
D. 活性維生素 D3（calcitriol）

正確答案：B. 皮質醛固酮（aldosterone）